下列有關牙齒的敘述，何者正確？
A. 星形網（stellate reticulum）是由間葉（mesenchyme）衍生而來
B. 琺瑯質（enamel）是由外胚層（ectoderm）衍生而來
C. 齒質（dentine）是人體中最硬的構造
D. 琺瑯質先形成之後，齒質再形成

正確答案：B. 琺瑯質（enamel）是由外胚層（ectoderm）衍生而來